Clinical trial exclusion criterion:
Identical HLA patients

Annotated entities:
- Condition: "Identical HLA"